Clinical trial exclusion criterion:
Severe renal insufficiency with estimated glomerular filtration rate <30 ml/min/ 1.73 m2

Annotated entities:
- Qualifier: "Severe"
- Condition: "renal insufficiency"
- Measurement: "estimated glomerular filtration rate"
- Value: "<30 ml/min/ 1.73 m2"